Clinical trial inclusion criterion:
1. Patients with histologically confirmed diagnosis of colorectal cancer presenting with unresectable stage IV (UICC) disease (primary tumor may be present)

Annotated entities:
- Parsing_Error: "1."
- Condition: "colorectal cancer"
- Qualifier: "unresectable"
- Condition: "disease"
- Undefined_semantics: "disease"
- Qualifier: "stage IV (UICC)"
- Value: "IV"
- Procedure: "histologically"
- Value: "confirmed"